下列那一個基因突變破壞時，就不會產生B及T細胞？
A. 末端去氧核苷酸轉移酶（terminal deoxynucleotidyl transferase, TdT）
B. ZAP-70
C. AID（activation-induced cytidine deaminase）
D. RAG1/RAG2重組酶（RAG1/RAG2 recombinase）

正確答案：D. RAG1/RAG2重組酶（RAG1/RAG2 recombinase）